依美國精神醫學會之「精神疾患診斷及統計手冊第四版」，反社會人格障礙症（antisocial personality  disorder）屬於下列何種群組之人格障礙？
A. A 群組（cluster A）
B. B 群組（cluster B）
C. C 群組（cluster C）
D. D 群組（cluster D）

正確答案：B. B 群組（cluster B）